治療性低溫療法可以改善心跳停止病人預後，目前建議之治療時低溫範圍為何？
A. 35-36°C
B. 32-34°C
C. 26-28°C
D. 22-25°C

正確答案：B. 32-34°C